intramural or subserosal leiomyomas,

The above is a clinical trial inclusion criterion. Annotated with entity spans:
[Condition: intramural] or [Condition: subserosal leiomyomas],